一位高位頸髓完全損傷病患，主述夜間經常做夢或醒來，早晨醒來常覺疲倦或頭痛，下列敘述或處置何者錯誤？
A. 可能是因為肺部低通氣（alveolar hypoventilation）
B. 可測量夜間脈動氧血紅素飽和度（SpO2）來確診
C. 病患的肺功能檢查FEV1/FVC會偏低
D. 病患的運動測試會顯示肺部死腔（dead space）增加

正確答案：C. 病患的肺功能檢查FEV1/FVC會偏低